下列關於酒精對睡眠影響之敘述，何者正確？
A. 整體而言有助於睡眠
B. 增加快速動眼（rapid eye movement）睡眠
C. 減少第四期睡眠
D. 減少睡眠中斷

正確答案：C. 減少第四期睡眠